Clinical trial exclusion criterion:
peripartum bleeding

Annotated entities:
- Condition: "peripartum bleeding"